Clinical trial inclusion criterion:
between 18-80 years old

Annotated entities:
- Value: "between 18-80 years"
- Person: "old"